下列有關輸尿管損傷之敘述何者正確？
A. 最常見之發生處為中 1/3 輸尿管
B. 大多數是在手術中發生，當時發現且馬上修補，其手術結果很好
C. 最常發生在大腸直腸切除術時
D. 婦科手術造成輸尿管損傷常發生在卵巢切除術

正確答案：B. 大多數是在手術中發生，當時發現且馬上修補，其手術結果很好